Clinical trial inclusion criterion:
Adult patients (18years old or older) undergoing living-donor or deceased-donor liver transplantation

Annotated entities:
- Person: "Adult"
- Value: "18years old or older"
- Person: "years"
- Procedure: "living-donor liver transplantation"
- Procedure: "deceased-donor liver transplantation"